body mass index > 35

The above is a clinical trial exclusion criterion. Annotated with entity spans:
[Measurement: body mass index] [Value: > 35]